Patient unable or unwilling to have high compression (30mmHg minimum)

The above is a clinical trial exclusion criterion. Annotated with entity spans:
[Post-eligibility: Patient unable or unwilling to have high compression (30mmHg minimum)]